Clinical trial inclusion criterion:
The treating physician has chosen Ventavis as a suitable long-term treatment for the patient

Entity relations:
- Has_multiplier("Ventavis", "long-term")